El trastorno desintegrativo infantil se caracteriza por:
1. Un desarrollo aparentemente normal durante al menos los dos primeros años de vida.
2. Presentarse únicamente en el sexo femenino.
3. No afectar a la capacidad intelectual de las personas que lo padecen.
4. No afectar a las habilidades de comunicación de la persona.
5. Un retraso en el desarrollo evidenciable desde el nacimiento.

Respuesta correcta: 1. Un desarrollo aparentemente normal durante al menos los dos primeros años de vida.